Clinical trial exclusion criterion:
Severe renal impairment creatinine clearance (CrCl), i.e. < 30 mL/min.

Entity relations:
- Has_qualifier("renal impairment", "Severe")
- AND("creatinine clearance", "CrCl")
- Has_value("creatinine clearance", "< 30 mL/min")